Clinical trial inclusion criterion:
Previous exposure to secukinumab or any other biologic drug directly targeting Interleukin-17 (IL-17), Interleukin-12/23 (IL-12/23), or the IL-17 receptor, or any other biologic immunomodulating agent, except those targeting TNFa

Annotated entities:
- Drug: "secukinumab"
- Drug: "biologic drug"
- Qualifier: "other"
- Drug: "Interleukin-17 (IL-17)"
- Condition: "targeting"
- Drug: "Interleukin-12/23 (IL-12/23)"
- Drug: "IL-17 receptor"
- Drug: "biologic immunomodulating agent"
- Negation: "except"
- Drug: "TNFa"